Any other primary DSM-IV diagnosis; DSM-IV criteria for body dysmorphic disorder, bipolar affective disorder, schizophrenia, psychotic disorder, current alcohol/substance abuse.

The above is a clinical trial exclusion criterion. Annotated with entity spans:
Any other [Qualifier: primary] [Qualifier: DSM-IV] [Condition: diagnosis]; [Measurement: DSM-IV criteria] for [Condition: body dysmorphic disorder], [Condition: bipolar affective disorder], [Condition: schizophrenia], [Condition: psychotic disorder,] current [Condition: alcohol]/[Condition: substance abuse].